Respecto a la enfermedad del injerto contra huésped (EICH) post-trasplante de progenitores hemopoyéticos. ¿Cuál de las siguientes afirmaciones es falsa?
1. El proceso fisiopatológico de la EICH tiene su origen en las células T del donante.
2. La profilaxis de la EICH consiste en tratamiento inmunosupresor, frecuentemente ciclosporina asociada a metotrexate, y el tratamiento de la EICH establecida consiste en corticoterapia.
3. La eliminación de los linfocitos del donante del injerto mejora el implante de los progenitores.
4. En la mayoría de los pacientes diagnosticados EICH crónica, ésta llega a desaparecer pudiendo interrumpir el tratamiento inmunosupresor sin que la enfermedad recidive.

Respuesta correcta: 3. La eliminación de los linfocitos del donante del injerto mejora el implante de los progenitores.